What condition is usually represented by the acronym SUDEP?

sudden unexpected death in epilepsy (SUDEP), Sudden Unexpected Death in Epilepsy (SUDEP)